Subjects diagnosed of schizophrenia as defined by Diagnostic and Statistical Manual of Mental Disorders, 4th edition text revision or 5th edition (DSM-<U+2163>-TR or 5) criteria, and a history of illness for at least for 3 years prior to screening.

The above is a clinical trial inclusion criterion. Annotated with entity spans:
Subjects diagnosed of [Condition: schizophrenia] as defined by [Qualifier: Diagnostic and Statistical Manual of Mental Disorders, 4th edition text revision or 5th edition (DSM-<U+2163>-TR or 5) criteria], and a [Temporal: history of illness] [Multiplier: for at least for 3 years] [Temporal: prior to screening].